Participants with low serum testosterone concentrations (< 300 ng/dL) who exhibit at least one sign or symptom of hypogonadism and have evidence of cardiovascular (CV) disease or are at an increased risk for CV disease.

The above is a clinical trial inclusion criterion. Annotated with entity spans:
Participants with [Value: low] [Measurement: serum testosterone concentrations] ([Value: < 300 ng/dL]) who exhibit [Multiplier: at least one] [Condition: sign] or [Condition: symptom] of [Condition: hypogonadism] and have [Mood: evidence of] [Condition: cardiovascular (CV) disease] or are at an [Mood: increased risk] for [Condition: CV disease].